¿Cuál de las siguientes afirmaciones sobre la leishmaniosis en España es correcta?
1. Está erradicada.
2. Es antroponótica.
3. Está asociada al VIH.
4. Es transmitida por Lutzomyia.
5. Es exclusivamente visceral.

Respuesta correcta: 3. Está asociada al VIH.